Subject with a total serum testosterone level = 300 ng/dL, with or without supplementation

The above is a clinical trial inclusion criterion. Annotated with entity spans:
Subject with a [Measurement: total serum testosterone level] [Value: = 300 ng/dL], with or without supplementation